Clinical trial inclusion criterion:
2. Pulmonary venous hypertension (measured as pulmonary capillary wedge pressure (PCWP) ≤15 mmHg. If PCWP is not available, then mean left atrial pressure or left ventricular end-diastolic pressure ≤15 mmHg in the absence of left atrial obstruction. and

Annotated entities:
- Parsing_Error: "2."
- Condition: "Pulmonary venous hypertension"
- Measurement: "pulmonary capillary wedge pressure (PCWP)"
- Value: "≤15 mmHg"
- Condition: "mean left atrial pressure"
- Condition: "left ventricular end-diastolic pressure"
- Value: "≤15 mmHg"
- Negation: "absence"
- Condition: "left atrial obstruction"